Patients with current scalp infection.

The above is a clinical trial exclusion criterion. Annotated with entity spans:
Patients with [Temporal: current] [Condition: scalp infection].